一位剛出生的男嬰，發現其臍部有類似腸道內容物流出來，則最可能的診斷是：
A. 開放性臍尿管（patent urachus）
B. 臍疝氣（umbilical hernia）
C. 開放性臍腸管（patent omphalomesenteric duct）
D. 臍膨出（omphalocele）

正確答案：C. 開放性臍腸管（patent omphalomesenteric duct）